1. Age 18 years or older

The above is a clinical trial inclusion criterion. Annotated with entity spans:
[Parsing_Error: 1.] [Person: Age] [Value: 18 years or older]